Clinical trial exclusion criterion:
15. Lack of availability for immunological and clinical follow-up assessment.

Entity relations:
- Has_negation("immunological follow-up assessment", "Lack of")
- Has_mood("immunological follow-up assessment", "availability for")
- OR("immunological follow-up assessment", "clinical follow-up assessment")